Clinical trial inclusion criterion:
Teeth with signs and symptoms of reversible pulpitis

Annotated entities:
- Qualifier: "Teeth"
- Condition: "reversible pulpitis"